Clinical trial exclusion criterion:
Unwillingness or inability to comply with protocol procedures and assessments

Annotated entities:
- Informed_consent: "Unwillingness or inability to comply with protocol procedures and assessments"